Clinical trial inclusion criteria:
1. Patients with histologically confirmed diagnosis of colorectal cancer presenting with unresectable stage IV (UICC) disease (primary tumor may be present)
2. Patients who are feasible for treatment with FOLFOX (prior adjuvant or palliative treatment is allowed)
3. ECOG Performance status ≤ 1
4. Life expectancy > 3 months
5. Age ≥18 years
6. Haematologic function as follows (5% deviation allowed):
ANC ≥ 1.5 x 109/L
platelets ≥ 100 x109/L
hemoglobin ≥ 9 g/dl or 5.59 mmol/l
7. Adequate liver function as follows (10% deviation allowed)
serum alanine transaminase (ALT) ≤ 2.5 x ULN (in case of liver metastases < 5 x ULN)
total bilirubin ≤ 1.5 x ULN (patients with Gilbert's syndrome total bilirubin ≤2.5 x ULN)
8. Adequate renal function as follows (10% deviation allowed)
· creatinine ≤ 1.5 x ULN
9. Signed written informed consent
10. Women of child-bearing potential must have a negative pregnancy test

Annotated entities:
- Parsing_Error: "1."
- Condition: "colorectal cancer"
- Qualifier: "unresectable"
- Condition: "disease"
- Undefined_semantics: "disease"
- Qualifier: "stage IV (UICC)"
- Value: "IV"
- Procedure: "histologically"
- Value: "confirmed"
- Parsing_Error: "2."
- Drug: "FOLFOX"
- Non-query-able: "feasible"
- Procedure: "palliative treatment"
- Procedure: "adjuvant treatment"
- Non-query-able: "is allowed"
- Parsing_Error: "3."
- Measurement: "ECOG Performance status"
- Value: "≤ 1"
- Parsing_Error: "4."
- Observation: "Life expectancy"
- Value: "> 3 months"
- Parsing_Error: "5."
- Person: "Age"
- Value: "≥18 years"
- Parsing_Error: "6."
- Parsing_Error: "Haematologic function as follows (5% deviation allowed):"
- Measurement: "ANC"
- Value: "≥ 1.5 x 109/L"
- Measurement: "platelets"
- Value: "≥ 100 x109/L"
- Measurement: "hemoglobin"
- Value: "≥ 9 g/dl"
- Value: "≥ 5.59 mmol/l"
- Parsing_Error: "7."
- Measurement: "liver function"
- Value: "Adequate"
- Parsing_Error: "Adequate liver function as follows (10% deviation allowed)"
- Measurement: "serum alanine transaminase (ALT)"
- Value: "≤ 2.5 x ULN"
- Condition: "liver metastases"
- Value: "< 5 x ULN"
- Measurement: "total bilirubin"
- Value: "≤ 1.5 x ULN"
- Condition: "Gilbert's syndrome"
- Measurement: "total bilirubin"
- Value: "≤2.5 x ULN"
- Parsing_Error: "8."
- Measurement: "renal function"
- Value: "Adequate"
- Parsing_Error: "Adequate renal function as follows (10% deviation allowed)"
- Measurement: "creatinine"
- Value: "≤ 1.5 x ULN"
- Parsing_Error: "9."
- Post-eligibility: "Signed written informed consent"
- Parsing_Error: "10."
- Condition: "child-bearing potential"
- Person: "Women"
- Measurement: "pregnancy test"
- Value: "negative"